固定脊髓的齒狀韌帶（denticulate ligament）是由下列何者形成？
A. 硬脊膜的骨膜層（periosteal layer of dural mater）
B. 硬脊膜的腦膜層（meningeal layer of dural mater）
C. 蜘蛛膜（arachnoid mater）
D. 軟膜（pia mater）

正確答案：D. 軟膜（pia mater）